有關fondaparinux敘述，下列何者錯誤？
A. 主要作用為抑制凝血因子thrombin
B. 透過antithrombin III結合作用來中和factor Xa
C. 採用皮下注射，每天一次
D. 腎臟疾病患者，不宜使用

正確答案：A. 主要作用為抑制凝血因子thrombin